Clinical trial exclusion criterion:
Implantation of a cardiac resynchronization therapy (CRT) device within 3 months or intent to implant a CRT.

Annotated entities:
- Device: "cardiac resynchronization therapy (CRT) device"
- Procedure: "Implantation"
- Temporal: "within 3 months"
- Mood: "intent"
- Procedure: "implant"
- Device: "CRT"